significant valvular disease,

The above is a clinical trial exclusion criterion. Annotated with entity spans:
[Qualifier: significant] [Condition: valvular disease],